Clinical trial exclusion criterion:
Known major fetal structural or chromosomal abnormality.

Entity relations:
- Has_qualifier("fetal structural", "major")
- OR("fetal structural", "chromosomal abnormality")